Clinical trial inclusion criterion:
4. Expectation of survival for at least 2 months.

Annotated entities:
- Observation: "Expectation"
- Condition: "survival"
- Temporal: "for at least 2 months"